Age less than 18 years

The above is a clinical trial exclusion criterion. Annotated with entity spans:
[Person: Age] [Value: less than 18 years]